Constant habitual diet patterns within last 3 months

The above is a clinical trial inclusion criterion. Annotated with entity spans:
[Condition: Constant habitual diet patterns] [Temporal: within last 3 months]